Clinical trial exclusion criterion:
Current use of fibrates (because of the risk of interaction with statins but will not exclude participants taking ezetimibe).

Annotated entities:
- Drug: "fibrates"